Clinical trial exclusion criterion:
congenital or valvular cardiomyopathy;

Entity relations:
- Has_qualifier("cardiomyopathy", "congenital")
- OR("congenital", "valvular")